Current use of laxatives, antacids, or other agents to lower stomach acidity?

The above is a clinical trial exclusion criterion. Annotated with entity spans:
Current use of [Drug: laxatives], [Drug: antacids], or [Qualifier: other] [Drug: agents to lower stomach acidity]?